Los ribosomas tienen tres sitios de unión para los RNAs de transferencia (RNAt), que son:
1. Sitio A de acetilo, P de propilo y E de etilo.
2. Sitio A de aminoacilo, P de peptidilo y E de salida (del inglés, exit).
3. Sitio A de aminoacilo, P de peptidilo y T de transferasa del péptido.
4. Sitio A de anterior, P de posterior y E de entrada (del inglés, entry).
5. Sitio A de aminoacilo, P de peptidilo y T de terminación.

Respuesta correcta: 2. Sitio A de aminoacilo, P de peptidilo y E de salida (del inglés, exit).